Unable to communicate because of severe hearing loss or speech disorder

The above is a clinical trial exclusion criterion. Annotated with entity spans:
[Condition: Unable to communicate] because of [Condition: severe hearing loss] or [Condition: speech disorder]